GOT和GPT指數是一般肝功能的指標，此兩種酵素具有那一類酵素活性？
A. kinase
B. decarboxylase
C. transaminase
D. methyltransferase

正確答案：C. transaminase